Clinical trial exclusion criterion:
Drug/alcohol abuse, psychological or spiritual illness that may interfere compliance to the study

Annotated entities:
- Intoxication_considerations: "Drug/alcohol abuse, psychological or spiritual illness that may interfere compliance to the study"